Clinical trial exclusion criterion:
Treatments or procedures indicated on the tear film dysfunction treatment, as punctal silicone plugs.

Entity relations:
- AND("tear film dysfunction treatment", "Treatments")
- AND("tear film dysfunction treatment", "punctal silicone plugs")
- OR("Treatments", "procedures")